Clinical trial inclusion criteria:
Subjects chronically infected with HCV Genotype 1
HCV RNA viral load of ≥ 10*5* IU/mL (100,000 IU/mL) at screening

Annotated entities:
- Condition: "HCV"
- Qualifier: "Genotype 1"
- Temporal: "chronically"
- Multiplier: "chronically"
- Measurement: "HCV RNA viral load"
- Value: "≥ 10*5* IU/mL"
- Value: "100,000 IU/mL"
- Temporal: "at screening"
- Reference_point: "screening"